Clinical trial exclusion criterion:
Current or recent infection

Entity relations:
- Has_temporal("infection", "Current")
- OR("Current", "recent")